下列何者最不可能造成甲狀腺功能亢進？
A. 葛瑞夫茲病（Graves' disease）
B. 橋本氏甲狀腺炎
C. 服用過量含碘物質
D. 甲狀腺癌

正確答案：D. 甲狀腺癌